Clinical trial exclusion criterion:
Any individual wearing a MedAlert bracelet indicating that he/she has formally opted out of the EvK Trial.

Annotated entities:
- Condition: "Any individual wearing a MedAlert bracelet indicating that he/she has formally opted out of the EvK Trial"